Clinical trial inclusion criterion:
Patients who have undergone prostatectomy: any rise in PSA or

Annotated entities:
- Procedure: "prostatectomy"
- Measurement: "PSA"
- Value: "rise"